Un paciente ingresa con el diagnóstico de hemorragia digestiva alta en situación hemodinámica estable. Se practica una gastroscopia que informa: “Lesión ulcerada en cara posterior del bulbo duodenal con hemorragia activa no pulsátil. Forrest Ib. Se practica esclerosis endoscópica con adrenalina consiguiéndose     hemostasia”.    Señala   la afirmación correcta:
1. La lesión descrita tiene un riesgo bajo de recidiva hemorrágica.
2. En caso de recidiva hemorrágica es imprescindible la intervención quirúrgica.
3. Por la localización de la lesión puede estar afectada la arteria gastroduodenal.
4. La descripción y localización de la úlcera sugieren una lesión de Dieulafoy.
5. En caso de intervención quirúrgica es obligatoria la práctica de una vagotomía troncular.

Respuesta correcta: 3. Por la localización de la lesión puede estar afectada la arteria gastroduodenal.